Clinical trial inclusion criterion:
Non-ST segement elevation acute coronary syndrome

Annotated entities:
- Condition: "Non-ST segement elevation"
- Condition: "acute coronary syndrome"